Possible pregnancy (confirmed by urine test)

The above is a clinical trial exclusion criterion. Annotated with entity spans:
[Mood: Possible] [Condition: pregnancy] ([Value: confirmed] by [Procedure: urine test])